Clinical trial exclusion criterion:
SBP=180mmHg, or DBP=110mmHg;

Annotated entities:
- Measurement: "SBP"
- Measurement: "DBP"
- Value: "=180mmHg"
- Value: "=110mmHg"